王小弟今年 8 歲，從小好動，連看卡通也坐不住，5 歲上幼稚園，上課時老是作弄同學，下課時常推倒同學，7 歲上小學，上課仍無法專心、愛講話，並開始出現頻頻眨眼、乾咳、清喉嚨的現象，3 個月前由老師建議去求診，醫師處方 ritalin-SR，王小弟上課的規矩明顯改善，功課進步，同學關係較少衝突，但最近 1 個月，王小弟卻常常出現不自主扮鬼臉抽搐的現象，又惹得同學不時譏笑，王小弟因此常常氣得哭了，王小弟最可能的診斷是什麼？①妥瑞氏症（Tourette's Disorder） ②慢性運動或語言抽搐症（chronic motor or vocal tic disorder） ③強迫症（obsessive-compulsive disorder） ④注意力不足症（attention-deficit disorder）
A. ①③
B. ②④
C. ①④
D. ③④

正確答案：C. ①④